Clinical trial exclusion criterion:
Patients already taking warfarin, cilostazol or any other type of anti-platelet agents except aspirin and clopidogrel

Annotated entities:
- Drug: "warfarin"
- Drug: "cilostazol"
- Drug: "anti-platelet agents"
- Drug: "aspirin"
- Drug: "clopidogrel"
- Negation: "except"